Clinical trial inclusion criterion:
2. Patients who are feasible for treatment with FOLFOX (prior adjuvant or palliative treatment is allowed)

Annotated entities:
- Parsing_Error: "2."
- Drug: "FOLFOX"
- Non-query-able: "feasible"
- Procedure: "palliative treatment"
- Procedure: "adjuvant treatment"
- Non-query-able: "is allowed"